Clinical trial exclusion criterion:
Application in the last 7 days at the site of injection of local treatments (apart emollients or antiseptics) or injections of botulism toxin or dynamic phototherapy or laser in the last 6 months.

Annotated entities:
- Temporal: "in the last 7 days"
- Procedure: "Application of local treatments"
- Drug: "emollients"
- Drug: "antiseptics"
- Negation: "apart"
- Drug: "botulism toxin"
- Procedure: "injections"
- Procedure: "dynamic phototherapy"
- Procedure: "laser"
- Temporal: "in the last 6 months"